Clinical trial inclusion criterion:
No signs of incomplete abortion

Annotated entities:
- Negation: "No"
- Condition: "signs of incomplete abortion"